Age 19 and more

The above is a clinical trial inclusion criterion. Annotated with entity spans:
[Person: Age] [Value: 19 and more]